Clinical trial inclusion criteria:
Highly active RMS as defined by:
One relapse in the previous year and at least 1 T1 Gadolinium (Gd)+ lesion or 9 or more T2 lesions, while on therapy with other disease modifying drugs (DMDs)
Two or more relapses in the previous year, whether on DMD treatment or not.
Expanded Disability Status Scale (EDSS) score less than equals to (<=) 5.0.
Other protocol defined inclusion criteria could apply.

Annotated entities:
- Qualifier: "Highly active"
- Condition: "RMS"
- Non-representable: "as defined by:"
- Multiplier: "One"
- Condition: "relapse"
- Temporal: "in the previous year"
- Multiplier: "at least 1"
- Condition: "lesion"
- Qualifier: "T1 Gadolinium (Gd)+"
- Multiplier: "9 or more"
- Condition: "T2 lesions"
- Temporal: "while on therapy"
- Reference_point: "therapy"
- Procedure: "therapy"
- Drug: "disease modifying drugs (DMDs)"
- Qualifier: "other"
- Multiplier: "Two or more"
- Condition: "relapses"
- Temporal: "in the previous year"
- Measurement: "Expanded Disability Status Scale (EDSS) score"
- Value: "less than equals to (<=) 5.0"
- Post-eligibility: "Other protocol defined inclusion criteria could apply."